Clinical trial inclusion criteria:
Histologically confirmed colorectal adenocarcinoma
Disease limited to the liver Unresectable disease by surgery or other local therapies
Age >18 years
ECOG performance status 0-2,Child pugh A or B
Expected survival = 3 months
Adequate hematological, hepatic, and renal function

Annotated entities:
- Qualifier: "Histologically confirmed"
- Procedure: "Histologically"
- Condition: "colorectal adenocarcinoma"
- Observation: "Disease limited to the liver"
- Condition: "Unresectable disease"
- Procedure: "surgery"
- Procedure: "local therapies"
- Qualifier: "other"
- Person: "Age"
- Value: ">18 years"
- Measurement: "ECOG performance status"
- Value: "0-2"
- Measurement: "Child pugh"
- Value: "A"
- Value: "B"
- Observation: "Expected survival"
- Value: "= 3 months"
- Qualifier: "Adequate"
- Measurement: "renal function"
- Measurement: "hepatic function"
- Measurement: "hematological function"